Clinical trial exclusion criterion:
Concurrent potentially life threatening arrhythmia or symptomatic arrhythmia

Entity relations:
- Has_qualifier("arrhythmia", "potentially life threatening")
- Has_qualifier("arrhythmia", "symptomatic")
- OR("arrhythmia", "arrhythmia")